Allergy or intolerance to (N)OAC or clopidogrel.

The above is a clinical trial exclusion criterion. Annotated with entity spans:
[Condition: Allergy] or [Condition: intolerance] to [Drug: (N)OAC] or [Drug: clopidogrel].